addiction to alcohol or recreational drugs

The above is a clinical trial exclusion criterion. Annotated with entity spans:
[Condition: addiction to alcohol] or recreational drugs